¿Para qué sirve la técnica de la flecha descendente en la terapia cognitiva de la depresión?
1. Para identificar los supuestos y creencias (esquemas cognitivos) que subyacen tras los problemas depresivos del paciente.
2. Para programar un número cada vez mayor de actividades agradables.
3. Para identificar situaciones de alto riesgo de recaída.
4. Para poner nombre a las distorsiones cognitivas que comete el paciente.
5. Para establecer el orden del día o agenda de la sesión.

Respuesta correcta: 1. Para identificar los supuestos y creencias (esquemas cognitivos) que subyacen tras los problemas depresivos del paciente.